BMI < 30

The above is a clinical trial inclusion criterion. Annotated with entity spans:
[Measurement: BMI] [Value: < 30]